HCV RNA > 103 IU/mL at screening

The above is a clinical trial inclusion criterion. Annotated with entity spans:
[Measurement: HCV RNA] [Value: > 103 IU/mL] [Temporal: at screening]